Clinical trial inclusion criterion:
Healthy at inclusion

Entity relations:
- Has_temporal("Healthy", "at inclusion")